Clinical trial inclusion criterion:
Minimal use of nasal decolonization* *Minimal use defined as <15% of residents receiving at least one chlorhexidine bath or nasal decolonization treatment during their nursing home stay.

Entity relations:
- Has_multiplier("nasal decolonization", "Minimal use")
- multi("chlorhexidine bath", "chlorhexidine")
- Has_multiplier("chlorhexidine bath", "at least one")
- multi("at least one", "chlorhexidine bath")
- Has_value("residents receiving at least one chlorhexidine bath", "<15%")
- Has_multiplier("Minimal use", "Minimal use")
- Has_temporal("nasal decolonization treatment", "during their nursing home stay")
- Subsumes("Minimal use", "residents receiving at least one chlorhexidine bath")
- OR("residents receiving at least one chlorhexidine bath", "nasal decolonization treatment")